下列有關腦性麻痺之敘述，何者錯誤？
A. 是一種症候群（syndrome）
B. 主要以智能障礙為主
C. 常合併其他神經功能障礙
D. 在發展未成熟之腦部出現非進行性之病變或損傷

正確答案：B. 主要以智能障礙為主